Clinical trial exclusion criterion:
contraindications to dexmedetomidine

Annotated entities:
- Condition: "contraindications"
- Drug: "dexmedetomidine"